Clinical trial exclusion criterion:
History or presence of any clinically significant disease or disorder

Annotated entities:
- Qualifier: "clinically significant"
- Condition: "clinically significant disease"
- Condition: "clinically significant disorder"
- Undefined_semantics: "clinically significant disease or disorder"
- Subjective_judgement: "clinically significant disease or disorder"
- Temporal: "History"